3. Subject's lesion(s) is (are) amenable to stent treatment with currently available FDA-approved bare metal or drug eluting stents.

The above is a clinical trial inclusion criterion. Annotated with entity spans:
3. Subject's lesion(s) is (are) [Condition: amenable to stent treatment] with currently available FDA-approved [Device: bare metal] or [Device: drug eluting stents].